Where do centromeres locate according to the Rabl orientation of eukaryotic nuclei?

the nuclear membrane